有關催產素（Oxytocin）的敘述，下列何者錯誤？
A. 催生時使用催產素有一定的起始劑量和增加的速率
B. 催產素不應超過最大劑量（42 mU/min）
C. 催產素最常見的副作用是子宮破裂，尤其是發生在子宮無疤痕的經產婦
D. 催產素的副作用有水中毒（Water intoxication），會造成抽搐、昏迷和死亡

正確答案：C. 催產素最常見的副作用是子宮破裂，尤其是發生在子宮無疤痕的經產婦